Chronic alcohol taker

The above is a clinical trial exclusion criterion. Annotated with entity spans:
[Qualifier: Chronic] [Person: alcohol taker]